在罹患性早熟的男童中，下列那一項的致病機轉與其他三項不同？
A. 21-羥酶缺乏所致先天性腎上腺增生（congenital adrenal hyperplasia due to 21-hydroxylase deficiency）
B. 分泌人類絨膜性促素顱內腫瘤（HCG-secreting intracranial tumor）
C. 腎上腺皮質腫瘤（Adrenocortical tumor）
D. 腎上腺初徵提早出現（Premature adrenarche）

正確答案：D. 腎上腺初徵提早出現（Premature adrenarche）